Clinical trial exclusion criterion:
Less than 50 kg of weight

Entity relations:
- Has_value("weight", "Less than 50 kg")